下列那一項屬於糖尿病增生性視網膜病變？
A. cotton-wool spots
B. hard exudates
C. vitreal hemorrhage
D. microaneurysms

正確答案：C. vitreal hemorrhage